Other protocol defined inclusion/exclusion criteria may apply.

The above is a clinical trial exclusion criterion. Annotated with entity spans:
[Non-representable: Other protocol defined inclusion/exclusion criteria may apply.]